Clinical trial exclusion criterion:
Known or suspected allergy

Annotated entities:
- Condition: "allergy"
- Mood: "Known"
- Mood: "suspected"